abnormal renal function

The above is a clinical trial exclusion criterion. Annotated with entity spans:
[Condition: abnormal renal function]